Clinical trial exclusion criterion:
Allergy to any drugs

Annotated entities:
- Condition: "Allergy"
- Drug: "any drugs"